Clinical trial exclusion criterion:
Severe cardiovascular diseases;

Annotated entities:
- Condition: "cardiovascular diseases"
- Qualifier: "Severe"